Clinical trial exclusion criterion:
Operative findings not suggestive of endometriotic cyst

Annotated entities:
- Condition: "Operative findings"
- Negation: "not"
- Mood: "suggestive"
- Condition: "endometriotic cyst"